Clinical trial inclusion criterion:
No contraindication for Pregabalin use

Entity relations:
- AND("contraindication", "Pregabalin")
- Has_negation("contraindication", "No")